Presence of implanted ICD/CRT-D.

The above is a clinical trial exclusion criterion. Annotated with entity spans:
Presence of [Device: implanted ICD/CRT-D].